下列那一項不是潰瘍性結腸炎（ulcerative colitis）的特徵？
A. 大部分（＞50％）的潰瘍性結腸炎患者也患有原發性硬化性膽管炎（primary sclerosing cholangitis）
B. 可見pseudopolyps，嚴重時可造成toxic megacolon
C. 它通常影響直腸並向近端延伸
D. 發炎通常侷限於黏膜層及表淺的黏膜下層

正確答案：A. 大部分（＞50％）的潰瘍性結腸炎患者也患有原發性硬化性膽管炎（primary sclerosing cholangitis）